Clinical trial exclusion criterion:
13. attempt of suicide in the last 2 years or at suicidal risk assessed by SCID interview;

Annotated entities:
- Parsing_Error: "13."
- Condition: "attempt of suicide"
- Temporal: "in the last 2 years"
- Condition: "at suicidal risk"
- Procedure: "SCID interview"